¿Cuál de las siguientes afirmaciones se cumple en relación con el ciclo de la urea?:
1. Tiene lugar principalmente en el riñón.
2. No se consume energía en forma de ATP.
3. Los dos átomos de nitrógeno de la molécula de urea provienen del amoníaco y aspartato.
4. La urea se produce directamente por hodrólisis de citrulina.

Respuesta correcta: 3. Los dos átomos de nitrógeno de la molécula de urea provienen del amoníaco y aspartato.